複雜型部分發作（Complex partial seizure）的癲癇發作最常源自於何部位？
A. 額葉（Frontal lobe）
B. 顳葉（Temporal lobe）
C. 頂葉（Parietal lobe）
D. 枕葉（Occipital lobe）

正確答案：B. 顳葉（Temporal lobe）